Acutely ill hospitalised children

The above is a clinical trial inclusion criterion. Annotated with entity spans:
[Condition: Acutely ill] [Observation: hospitalised] [Person: children]